Clinical trial inclusion criterion:
Symptoms for at least 3 months

Entity relations:
- Has_temporal("Symptoms", "for at least 3 months")